Clinical trial exclusion criteria:
Upper urinary tract deterioration
Uncontrolled diabetes mellitus
Evident local or pelvic recurrence
Adjuvant chemotherapy
Chronic retention
Pouch stones
Urethral stricture or urethro-ileal maldirection
Sensitivity to Mebeverine
Untreated chronic constipation
Active symptomatic urinary infection

Annotated entities:
- Condition: "Upper urinary tract deterioration"
- Condition: "diabetes mellitus"
- Qualifier: "Uncontrolled"
- Condition: "pelvic recurrence"
- Condition: "local recurrence"
- Procedure: "Adjuvant chemotherapy"
- Condition: "Chronic retention"
- Condition: "Pouch stones"
- Condition: "Urethral stricture"
- Condition: "urethro-ileal maldirection"
- Drug: "Mebeverine"
- Condition: "Sensitivity"
- Qualifier: "Untreated"
- Condition: "chronic constipation"
- Qualifier: "symptomatic"
- Qualifier: "Active"
- Condition: "urinary infection"